Clinical trial inclusion criterion:
Adequate bone marrow function(absolute neutrophil count [ANC] ≥1,500/µL, hemoglobin ≥9.0 g/dL,and platelets ≥100,000/µL)

Entity relations:
- Has_value("bone marrow function", "Adequate")
- Has_value("absolute neutrophil count [ANC]", "≥1,500/µL")
- Has_value("hemoglobin", "≥9.0 g/dL")
- Has_value("platelets", "≥100,000/µL")
- Subsumes("Adequate", "absolute neutrophil count [ANC]")
- OR("absolute neutrophil count [ANC]", "hemoglobin", "platelets")